Clinical trial inclusion criterion:
Diagnosis reviewed at transplant center and confirmed to fit the criterion for high risk blood disease or cancer, as defined for the study

Annotated entities:
- Condition: "high risk blood disease"
- Condition: "cancer"